Clinical trial inclusion criterion:
Sex for exchange of money, goods or services

Annotated entities:
- Observation: "Sex for exchange of money, goods or services"